Clinical trial inclusion criterion:
2. Subject requires single- or multi-vessel percutaneous coronary intervention (PCI) of de novo or restenotic target lesion (including in-stent restenotic lesions).

Annotated entities:
- Procedure: "percutaneous coronary intervention (PCI)"
- Qualifier: "single- vessel"
- Qualifier: "multi-vessel"
- Condition: "target lesion"
- Condition: "in-stent restenotic lesions"
- Qualifier: "de novo"
- Qualifier: "restenotic"
- Qualifier: "in-stent"
- Qualifier: "restenotic"